Clinical trial exclusion criterion:
Use of probenecid like drugs

Annotated entities:
- Drug: "probenecid like drugs"
- Drug: "probenecid"
- Qualifier: "probenecid like"